Clinical trial exclusion criterion:
1. Decrease in size of the designated target ulcer(s) by ≥ 30% during the 7-day screening period

Entity relations:
- Has_temporal("≥ 30%", "during the 7-day screening period")
- Has_qualifier("target ulcer", "Decrease in size")
- Has_value("Decrease in size", "≥ 30%")